Clinical trial exclusion criterion:
Any anti-coagulation therapy (apart from rivaroxaban for second objective)

Annotated entities:
- Procedure: "anti-coagulation therapy"
- Drug: "rivaroxaban"
- Negation: "apart from"